Born after a gestation period between 36 and 42 weeks.

The above is a clinical trial inclusion criterion. Annotated with entity spans:
[Condition: Born] after a [Measurement: gestation period] [Value: between 36 and 42 weeks].